Patients suspected to have vitamin B12 deficiency defined as a plasma vitamin B12 below the reference interval (<200 pmol/L).

The above is a clinical trial inclusion criterion. Annotated with entity spans:
Patients [Mood: suspected] to have [Condition: vitamin B12 deficiency] defined as a [Measurement: plasma vitamin B12] [Value: below the reference interval] ([Value: <200 pmol/L]).